Treatment with prednisolone (or prednisone, or equivalent) at >20 mg/D for over 4 weeks within the past 3 months.

The above is a clinical trial exclusion criterion. Annotated with entity spans:
Treatment with [Drug: prednisolone] (or [Drug: prednisone], or equivalent) at [Multiplier: >20 mg/D for over 4 weeks] within the [Temporal: past 3 months].